History of allergy, hypersensitivity, or intolerance to HORIZANT or any other gabapentin products (eg, Neurontin®, Gralise®).

The above is a clinical trial exclusion criterion. Annotated with entity spans:
History of [Condition: allergy], [Condition: hypersensitivity], or [Condition: intolerance] to [Drug: HORIZANT] or any other [Drug: gabapentin] products (eg, [Drug: Neurontin]®, [Drug: Gralise]®).